Clinical trial exclusion criterion:
Major surgery within 6 weeks

Annotated entities:
- Temporal: "within 6 weeks"
- Procedure: "Major surgery"